Any active respiratory, cardiovascular or other disease requiring regular treatment or being otherwise relevant for tolerance of hypoxia or altitude exposure.

The above is a clinical trial exclusion criterion. Annotated with entity spans:
Any [Qualifier: active] [Condition: respiratory], [Condition: cardiovascular] or [Qualifier: other] [Condition: disease] [Mood: requiring] regular [Procedure: treatment] or being otherwise [Mood: relevant] for [Condition: tolerance] of [Condition: hypoxia] or [Condition: altitude exposure].